Clinical trial inclusion criterion:
the surgery is laparoscopic surgery and is expected to last for = 2 hours under general anesthesia and the patient will stay in hospital for at least 7 days after surgery.

Annotated entities:
- Procedure: "laparoscopic surgery"
- Measurement: "last"
- Value: "= 2 hour"
- Mood: "expected"
- Qualifier: "under general anesthesia"
- Mood: "will"
- Procedure: "stay in hospital"
- Value: "at least 7 days after surgery"